13. Mobitz Type II or III° atrial ventricular block，severe ventricular arrhythmia (polymorphic and frequent premature ventricular beats, frequent non-sustained ventricular tachycardia);

The above is a clinical trial exclusion criterion. Annotated with entity spans:
13. [Measurement: Mobitz] [Value: Type II or III]° [Condition: atrial ventricular block]，[Qualifier: severe] [Condition: ventricular arrhythmia] ([Qualifier: polymorphic] and [Multiplier: frequent] [Observation: premature ventricular beats], [Multiplier: frequent] [Qualifier: non-sustained] [Condition: ventricular tachycardia]);